Clinical trial exclusion criterion:
History of organic brain disease

Entity relations:
- Has_temporal("organic brain disease", "History of")